Coadministration of more than 20 mg atorvastatin; 10 mg rosuvastatin; 20 mg of fluvastatin, lovastatin or simvastatin

The above is a clinical trial exclusion criterion. Annotated with entity spans:
Coadministration of [Multiplier: more than 20 mg] [Drug: atorvastatin]; 10 mg [Drug: rosuvastatin]; 20 mg of [Drug: fluvastatin], [Drug: lovastatin] or [Drug: simvastatin]